Clinical trial exclusion criterion:
Chronic kidney disease

Annotated entities:
- Qualifier: "Chronic"
- Condition: "kidney disease"